想調查成骨不全症（玻璃娃娃）患者的生活品質，下列那一種抽樣方法最恰當？
A. 簡單隨機抽樣
B. 分層隨機抽樣
C. 滾雪球抽樣
D. 配額抽樣

正確答案：C. 滾雪球抽樣